Clinical trial exclusion criterion:
known or presumed abnormal coagulation status

Annotated entities:
- Condition: "abnormal coagulation status"
- Qualifier: "presumed"
- Qualifier: "known"